Not seeking medication abortion

The above is a clinical trial exclusion criterion. Annotated with entity spans:
Not seeking [Procedure: medication abortion]